Clinical trial exclusion criterion:
Total lesion area of >12 DA or >30.5 mm2

Annotated entities:
- Measurement: "Total lesion area"
- Value: ">12 DA"
- Value: ">30.5 mm2"